Clinical trial inclusion criterion:
cycle length 25-34 days

Annotated entities:
- Measurement: "cycle length"
- Value: "25-34 days"